一位 40 歲男性因腹痛來急診，病人主訴前夜與友人飲酒，來急診當天下午開始腹痛，噁心、嘔吐，腹部 X 光呈現麻痺性腸阻塞（paralytic ileus），但腹部無明顯壓痛或回彈痛（rebound pain），抽血檢查 g/dL、WBC 9600/μL、Na 130 mM、K 3.2 mM，尿液檢查發現比重 1.020、pH 7.0、protein (-)、 glucose (-)、ketone body (-)、urobilinogen (+++)、bilirubin (-)，4 小時後病人開始意識不清，不久接著抽搐。下列處置何者最適當？
A. 給予 3% NaCl 注射
B. 給予 phenytoin 治療
C. 給予灌腸（enema）促進腸蠕動
D. 給予 Hematin 靜脈注射

正確答案：D. 給予 Hematin 靜脈注射